Clinical trial inclusion criterion:
1 to 17 years of age (before 18th birthday)

Entity relations:
- Has_value("age", "1 to 17 years")